Clinical trial inclusion criterion:
Postoperative TNM(primary tumor,regional nodes,metastasis) staging III~IV, positive surgical margin.

Entity relations:
- Has_qualifier("TNM staging", "Postoperative")
- Has_value("surgical margin", "positive")
- Has_value("TNM staging", "III~IV,")